Clinical trial exclusion criterion:
Gestational age less than 37 completed weeks

Annotated entities:
- Measurement: "Gestational age"
- Value: "less than 37 completed weeks"